Initial WBC < 20,000/µL

The above is a clinical trial inclusion criterion. Annotated with entity spans:
[Line: Initial WBC < 20,000/µL]